Clinical trial inclusion criterion:
patients who underwent successful TAVI

Entity relations:
- Has_qualifier("TAVI", "successful")